Clinical trial exclusion criterion:
Anaphylactic reaction to a previous dose of influenza vaccine or to any of its components

Entity relations:
- Has_temporal("influenza vaccine", "previous")
- AND("Anaphylactic reaction", "influenza vaccine")
- OR("influenza vaccine", "its components")